1. Clinically significant microvascular complications: nephropathy (estimated glomerular filtration rate below 40 ml/min), neuropathy (especially diagnosed gastroparesis) or severe proliferative retinopathy as judged by the investigator.

The above is a clinical trial exclusion criterion. Annotated with entity spans:
[Parsing_Error: 1.] Clinically significant [Condition: microvascular complications]: [Condition: nephropathy] ([Measurement: estimated glomerular filtration rate] [Value: below 40 ml/min]), [Condition: neuropathy] (especially diagnosed [Condition: gastroparesis]) or [Condition: severe proliferative retinopathy] [Subjective_judgement: as judged by the investigator].